Clinical trial exclusion criterion:
Female subjects who are pregnant or lactating

Entity relations:
- OR("pregnant", "lactating")